如果要進行一項關於低劑量輻射與內分泌病變的前瞻性世代研究，下列那些人不應納入研究成員？
A. 3 歲以下小孩
B. 車禍骨折者
C. 反核之活躍分子
D. 患有甲狀腺腫大者

正確答案：D. 患有甲狀腺腫大者